Clinical trial exclusion criterion:
Subjects with medical conditions that preclude the testing required by the protocol or limit study participation

Entity relations:
- AND("preclude", "testing required by the protoco")
- AND("medical conditions", "preclude")
- OR("preclude", "limit study participation")